84 歲男性，因胃潰瘍大量出血，收縮壓降至 60 mmHg，有心衰竭病史，其血壓用升壓劑勉強維持在 90/65 mmHg 左右，血中尿素氮（BUN）升至 145 mg/dL，肌酸酐（creatinine）11.5 mg/dL，每天尿總量只有 75 c.c.，血紅素為 7 g/dL，需輸血及大量輸液治療約 2,500-3,500 mL / 天，下列何種透析療法對他最為合適？
A. 連續性靜脈靜脈血液透析（continuous veno-venous hemodialysis; CVVH / D）
B. 連續可活動性腹膜透析（continuous ambulatory peritoneal dialysis; CAPD）
C. 間歇性血液透析（intermittent hemodialysis; IH / D）
D. 血液灌注術（hemoperfusion; HP）

正確答案：A. 連續性靜脈靜脈血液透析（continuous veno-venous hemodialysis; CVVH / D）